Clinical trial exclusion criterion:
hepatic insufficiency (three times the upper limit of normal (ULN) for aspartate aminotransferase (AST) and/or alanine aminotransferase (ALT)); liver transplant recipient; cirrhosis of the liver;

Entity relations:
- Subsumes("aspartate aminotransferase", "AST")
- Subsumes("alanine aminotransferase", "ALT")
- Has_value("aspartate aminotransferase", "three times the upper limit of normal")
- Subsumes("hepatic insufficiency", "aspartate aminotransferase")
- OR("aspartate aminotransferase", "alanine aminotransferase")
- OR("hepatic insufficiency", "liver transplant", "cirrhosis of the liver")